Clinical trial exclusion criterion:
Subjects taking the following medications for at least six weeks, which may interfere with the study, will be excluded: BAS, antibiotics, anticoagulants, anticonvulsants, antiarrhythmic, Cyclosporine, Mycophenolate and Synthroid. Subjects with chronic diarrhea, gastric bypass or lap band procedures, ostomies, bowel motility problems, or other conditions that could affect intestinal fat absorption.

Entity relations:
- Has_temporal("BAS", "for at least six weeks")
- Has_temporal("and", "for at least six weeks")
- OR("BAS", "Mycophenolate", "Cyclosporine", "antiarrhythmic", "anticonvulsants", "anticoagulants", "antibiotics", "Synthroid")
- OR("chronic diarrhea", "conditions that could affect intestinal fat absorption", "ostomies", "lap band procedures", "gastric bypass", "bowel motility problems")